Clinical trial exclusion criterion:
Severe visual impairment, which would preclude completion of the assessments and/or intervention

Annotated entities:
- Condition: "visual impairment"
- Qualifier: "Severe"